Clinical trial exclusion criterion:
Psychiatric antecedent

Annotated entities:
- Condition: "Psychiatric"
- Temporal: "antecedent"